Clinical trial exclusion criterion:
heart failure

Annotated entities:
- Condition: "heart failure"